diagnosed congenital long QT syndrome

The above is a clinical trial exclusion criterion. Annotated with entity spans:
diagnosed [Condition: congenital long QT syndrome]